Clinical trial exclusion criteria:
Patients who have previous prostate surgery Patients who have muscle invasive bladder cancer

Annotated entities:
- Temporal: "previous"
- Condition: "prostate surgery"
- Line: "Patients who have muscle invasive bladder cancer"
- Line: "Patients who have previous prostate surgery"
- Condition: "bladder cancer"
- Qualifier: "muscle invasive"